¿Cuál de las siguientes técnicas de tinción posee importancia en el diagnóstico de infecciones causadas por Corynebacterium diphtheriae?
1. La tinción de cápsula.
2. La tinción de gránulos metacromáticos.
3. La tinción de ácido-alcohol resistencia.
4. La tinción negativa.
5. La tinción de endosporas.

Respuesta correcta: 2. La tinción de gránulos metacromáticos.